La presencia de un trastorno mental y el uso patológico de sustancias tóxicas:
1. Se refiere al concepto de Patología Dual, un tipo específico de comorbilidad diagnóstica.
2. Es una entidad patológica que no existe.
3. Es sinónimo de trastorno bipolar.
4. Hace referencia a personas mayores que presentan simultáneamente dos o más enfermedades mentales.
5. Constituye una etiqueta diagnóstica sin relevancia desde la perspectiva clínica como social.

Respuesta correcta: 1. Se refiere al concepto de Patología Dual, un tipo específico de comorbilidad diagnóstica.